Cardiac ischemia, cardiac arrhythmias or congestive heart failure uncontrolled by medication

The above is a clinical trial exclusion criterion. Annotated with entity spans:
[Condition: Cardiac ischemia], [Condition: cardiac arrhythmias] or [Condition: congestive heart failure] [Qualifier: uncontrolled by medication]